一位年輕男性打球時扭傷了膝部，有人告訴他可能傷到了半月板（meniscus），下列那一種檢測最可能出現陽性反應？
A. 向前拉曳徵象（anterior drawer test）
B. 麥克默里氏檢查（McMurray's test）
C. 樞軸移位測試（pivot-shift test）
D. 拉克曼氏手法（Lachman's maneuver）

正確答案：B. 麥克默里氏檢查（McMurray's test）